What is the basis of the Sp3 procedure used in proteomics?

SP3, a novel technology for proteomic sample preparation using magnetic beads. SP3 provides a rapid and unbiased means of proteomic sample preparation in a single tube that facilitates ultrasensitive analysis by outperforming existing protocols in terms of efficiency, scalability, speed, throughput, and flexibility.